關於C型肝炎（hepatitis C），下列何者錯誤？
A. 和B型肝炎相比，C型肝炎垂直感染（perinatal transmission）的比率較低
B. 若母親為C型肝炎帶原者且合併有高病毒血症或合併有愛滋病毒感染時，則垂直感染的風險會增加
C. C型肝炎急性感染20～30年後，部分患者會進展至肝硬化（cirrhosis）、肝衰竭（liver failure）甚至肝癌
D. 目前可以接種疫苗預防

正確答案：D. 目前可以接種疫苗預防